Clinical trial exclusion criterion:
Pregnancy induced hypertension

Entity relations:
- multi("Pregnancy induced", "Pregnancy")
- Has_qualifier("hypertension", "Pregnancy induced")